小兒細菌性眼窩蜂窩組織炎（bacterial orbital cellulitis）最常繼發於下列那一處鼻竇之感染？
A. 額竇（frontal sinus）
B. 篩竇（ethmoid sinus）
C. 蝶竇（sphenoid sinus）
D. 上頷竇（maxillary sinus）

正確答案：B. 篩竇（ethmoid sinus）